老人用藥原則不包括下列何者？
A. 蒐集詳細用藥習慣
B. 有症狀就應給予藥物治療
C. 簡化治療
D. 從少量藥物開始

正確答案：B. 有症狀就應給予藥物治療